Clinical trial exclusion criteria:
Prior treatment with more than 6 cycles of traditional alkylating agent-based chemotherapy regimens
Prior treatment with more than 2 cycles of carboplating-based chemotherapy regimens
For colorectal cancer patients in the expanded cohorts, prior treatment with more than 2 systemic chemotherapy regimens in the metastatic setting

Annotated entities:
- Procedure: "treatment"
- Temporal: "Prior"
- Procedure: "chemotherapy regimens"
- Qualifier: "alkylating agent-based"
- Value: "more than 6 cycles"
- Qualifier: "carboplating-based"
- Value: "more than 2 cycles"
- Procedure: "treatment"
- Temporal: "Prior"
- Procedure: "chemotherapy regimens"
- Condition: "colorectal cancer"
- Procedure: "treatment"
- Temporal: "prior"
- Value: "more than 2"
- Procedure: "systemic chemotherapy regimens"
- Qualifier: "metastatic"